Treated with an investigational RA drug in the last 6 months

The above is a clinical trial exclusion criterion. Annotated with entity spans:
Treated with an [Qualifier: investigational] [Drug: RA drug] [Temporal: in the last 6 months]